下列那項不是妊娠第 1 期（first trimester）超音波檢查必須檢查之項目？
A. Fetal presentation
B. Gestational sac location
C. Crown-rump length
D. Fetal heart motion

正確答案：A. Fetal presentation